使用靜脈注射 cyclophosphamide 來治療全身性紅斑狼瘡（systemic lupus erythematosus）患者合併嚴重性腎炎（lupus nephritis）時，下列那一項不是其常見的併發症？
A. 發生骨髓造血功能抑制
B. 發生細菌性膀胱炎
C. 發生不孕症
D. 掉頭髮

正確答案：B. 發生細菌性膀胱炎